Clinical trial exclusion criterion:
poor tolerance of or technical difficulties with performing transesophageal echocardiography

Annotated entities:
- Condition: "poor tolerance"
- Observation: "technical difficulties"
- Procedure: "transesophageal echocardiography"